no history of anesthesia medication allergy.

The above is a clinical trial inclusion criterion. Annotated with entity spans:
[Negation: no] [Temporal: history] of [Drug: anesthesia medication] [Condition: allergy].